Clinical trial exclusion criterion:
Patients with history of bowel obstruction, perforation.

Annotated entities:
- Condition: "bowel obstruction"
- Condition: "bowel perforation"
- Temporal: "history"